Having undergone lung surgery (e.g. lung resection including lung volume reduction surgery, lung transplant) or subjects scheduled for surgery.

The above is a clinical trial exclusion criterion. Annotated with entity spans:
Having undergone [Procedure: lung surgery] (e.g. [Procedure: lung resection] including [Procedure: lung volume reduction surgery], [Procedure: lung transplant]) or subjects [Mood: scheduled] for [Procedure: surgery].